當我們面對壓力時，以下何者最具有緩衝壓力（stress-buffering）的功能？
A. 自我效能
B. 楷模典範
C. 社會支持
D. 自我增能

正確答案：C. 社會支持